Clinical trial exclusion criteria:
ED physicians who work casually (less than 0.25 Full Time Equivalent)
ED Physicians who are routinely using U/S guided RA for hip fracture patients, or decline participation in the trial.
Patients' age less than 65 years;
Patients who are delirious on initial assessment by ED physician or severe dementia
Patients with communication problems (critically ill, unconscious, language barrier despite use of secure telephone-based translation service)
Patients with allergies to narcotics or local anesthetic; or anticoagulant use (e.g. warfarin, dabigatran, rivaroxaban).
Patients with hip fractures not requiring surgery (e.g. greater trochanter avulsion) will also be excluded.

Annotated entities:
- Non-query-able: "ED physicians who work casually (less than 0.25 Full Time Equivalent)"
- Non-query-able: "ED Physicians who are routinely using U/S guided RA for hip fracture patients, or decline participation in the trial."
- Value: "less than 65 years"
- Person: "age"
- Condition: "delirious"
- Temporal: "on initial assessment"
- Reference_point: "initial assessment"
- Condition: "dementia"
- Qualifier: "severe"
- Condition: "communication problems"
- Undefined_semantics: "communication problems"
- Condition: "critically ill"
- Condition: "unconscious"
- Condition: "language barrier"
- Condition: "allergies"
- Drug: "narcotics"
- Drug: "local anesthetic"
- Drug: "anticoagulant"
- Drug: "warfarin"
- Drug: "dabigatran"
- Drug: "rivaroxaban"
- Condition: "hip fractures"
- Procedure: "surgery"
- Qualifier: "requiring surgery"
- Negation: "not"
- Condition: "greater trochanter avulsion"
- Undefined_semantics: "hip fractures not requiring surgery"